八八水災造成屏東低窪地區嚴重淹水，十天後，該地區有位50歲男性發生急性高燒38.5°C 、頭痛、肌肉酸痛，週邊血白血球為 17,000/µL，血小板120,000/µL，GOT：150 U/L及GPT：162 U/L，總膽紅素（total bilirubin）：4.1 mg/dL；血清肌酸酐
 （serum creatinine）：3.2 mg/dL。下列何種抗生素為最適當之治療選擇？
A. amikacin
B. ciprofloxacin
C. crystal penicillin G
D. vancomycin

正確答案：C. crystal penicillin G